Congestive heart failure (patients with LVEF <30% or cardiogenic shock)

The above is a clinical trial exclusion criterion. Annotated with entity spans:
[Condition: Congestive heart failure] (patients with [Measurement: LVEF] [Value: <30%] or [Condition: cardiogenic shock])